一位 45 歲中年男子，主訴呼吸短促，胸部 X 光顯示，右肺區 hyperlucent 且有右肺塌陷呈白色陰影貼近心臟邊緣，縱膈腔左移。下列何項為 有可能的診斷？
A. 肺結核
B. 肋膜炎
C. 肺氣腫破裂
D. 肺癌

正確答案：C. 肺氣腫破裂